有關經前症候群（premenstrual syndrome）症狀，下列何者不常見？
A. 憂鬱（depression）
B. 焦慮（anxiety）
C. 熱潮紅（hot flashes）
D. 腹脹（abdominal bloating）

正確答案：C. 熱潮紅（hot flashes）